Clinical trial exclusion criterion:
Known allergy/ hypersensitivity reaction to Brimonidine

Entity relations:
- AND("allergy", "Brimonidine")
- OR("allergy", "hypersensitivity")